Señale cuál de los siguientes NO es un de las “áreas problemáticas” en las que explícitamente se centra la “Terapia Interpersonal” de la depresión:
1. El duelo.
2. Los sucesos traumáticos familiares.
3. Las disputas interpersonales.
4. La transición de rol.
5. Los déficit interpersonales.

Respuesta correcta: 2. Los sucesos traumáticos familiares.